Clinical trial exclusion criterion:
medical history that contraindicates the use of epinephrine

Annotated entities:
- Temporal: "medical history"
- Condition: "contraindicates"
- Drug: "epinephrine"